El alcohol isopropílico se prepara a partir de petróleo por hidratación de:
1. Isobuteno.
2. Eteno.
3. Penteno.
4. Buteno.
5. Propeno.

Respuesta correcta: 5. Propeno.